Past or planned surgery affecting gastric acid secretion.

The above is a clinical trial exclusion criterion. Annotated with entity spans:
[Temporal: Past] or [Mood: planned] [Procedure: surgery] [Qualifier: affecting gastric acid secretion].